嵌入型的膜蛋白（integral membrane protein）能夠被下列何種溶液萃取出來？
A. 鹼性或酸性的緩衝溶液
B. 能移除陽離子的螯合劑（chelating agent）溶液
C. 含介面活性劑（surfactant）的溶液
D. 高濃度的鹽溶液

正確答案：C. 含介面活性劑（surfactant）的溶液